H-pylori positive cases.

The above is a clinical trial inclusion criterion. Annotated with entity spans:
[Condition: H-pylori positive] cases.